Presence of measurable lesions (=10mm on spiral CT scan) subject to RECIST 1.1;

The above is a clinical trial inclusion criterion. Annotated with entity spans:
Presence of [Condition: measurable lesions] ([Value: =10mm] on [Procedure: spiral CT scan]) subject to [Qualifier: RECIST 1.1];